Clinical trial exclusion criteria:
No Down syndrome
No other major disease that prohibits study treatment (e.g., severe congenital heart disease)
Not requiring significant therapy modification owing to study therapy associated complications
No complications due to other interventions
No one with missing data that are needed for the differential diagnosis, or for selection of the proper therapy arm

Annotated entities:
- Negation: "No"
- Condition: "Down syndrome"
- Negation: "No"
- Condition: "major disease"
- Qualifier: "other"
- Condition: "congenital heart disease"
- Qualifier: "severe"
- Non-query-able: "that prohibits study treatment"
- Negation: "Not"
- Procedure: "study therapy"
- Condition: "complications"
- Non-query-able: "Not requiring significant therapy modification owing to study therapy associated complications"
- Negation: "No"
- Procedure: "interventions"
- Qualifier: "other"
- Condition: "complications"
- Negation: "No"
- Non-query-able: "o one with missing data that are needed for the differential diagnosis, or for selection of the proper therapy arm"